Clinical trial inclusion criterion:
Age of onset of first episode = 50 years with up to three depressive episodes;

Entity relations:
- Has_value("Age", "= 50 years")
- AND("onset of first episode", "Age")
- Has_multiplier("depressive episodes", "three")